Clinical trial inclusion criterion:
Patients must have signed an informed consent document stating that they understand the investigational nature of the proposed treatment

Annotated entities:
- Informed_consent: "signed an informed consent document"